Clinical trial exclusion criterion:
3. Women who are pregnant or are attempting conception, especially in the presence of a history of recurrent spontaneous abortion.

Annotated entities:
- Person: "Women"
- Condition: "pregnant"
- Condition: "spontaneous abortion"
- Temporal: "recurrent"